Which is the main gene signature in Systemic Lupus Erythematosus (SLE)?

Systemic Lupus Erythematosus (SLE) is a type I interferon (IFN) disease. The main gene signature is a 4-gene expression of 4 genes.